Clinical trial inclusion criteria:
Adult (>18 years of age and older) patients who have or will have undergone surgical resection or biopsy of a supratentorial brain tumor and are able to consent for themselves.
Able to be randomized prior to or up to 48 hours after surgery.

Annotated entities:
- Person: "Adult"
- Value: "and older >18 years"
- Person: "age"
- Mood: "will have undergone"
- Procedure: "surgical resection"
- Procedure: "biopsy"
- Condition: "supratentorial brain tumor"
- Informed_consent: "are able to consent for themselves"
- Non-representable: "Able to be randomized prior to or up to 48 hours after surgery."